What is the mode of action of the drug Prolia?

Prolia, also known as denosumab is an anti-RANKL agent for the treatment of osteoporosis. It works by preventing the development of osteoclasts which are cells that break down bone.